Clinical trial exclusion criterion:
No current treatment plan at OHSU

Annotated entities:
- Mood: "treatment plan"
- Negation: "No"
- Temporal: "current"
- Visit: "OHSU"